Clinical trial exclusion criterion:
Known clotting disorder or use of anticoagulants

Annotated entities:
- Condition: "clotting disorder"
- Drug: "anticoagulants"